Clinical trial exclusion criterion:
If 30 days have not elapsed after the date of signing of the previous clinical trial or currently participating in other clinical trials.

Annotated entities:
- Competing_trial: "If 30 days have not elapsed after the date of signing of the previous clinical trial or currently participating in other clinical trials."